Clinical trial exclusion criteria:
Having experienced severe allergies, trauma history and/or operation history within 3 months;
With a history of mental illness and/or family history of mental illness;
Limb disabled;
Taking medicine within one month;
Suffering major events or having mood swings.

Annotated entities:
- Condition: "severe allergies"
- Condition: "trauma"
- Procedure: "operation"
- Temporal: "within 3 months"
- Condition: "mental illness"
- Observation: "family history"
- Condition: "mental illness"
- Temporal: "history"
- Condition: "Limb disabled"
- Drug: "medicine"
- Temporal: "within one month"
- Non-query-able: "Taking medicine within one month"
- Condition: "major events"
- Undefined_semantics: "major events"
- Subjective_judgement: "major events"
- Condition: "mood swings"